平滑肌細胞內，細絲（thin filaments）和中間絲（intermediate filaments）會固	在下列何者？
A. 胞飲小泡（pinocytotic vesicles）
B. 橫小管（T-tubules）
C. 細胞膜小凹（caveolae）
D. 緻密體（dense body）

正確答案：D. 緻密體（dense body）